Clinical trial exclusion criterion:
BDI = 30 points

Entity relations:
- Has_value("BDI", "= 30 points")